¿Qué opción corresponde a la albúmina?:
1. Es una proteína exclusivamente plasmática.
2. Presenta un solo sitio de unión.
3. Fija fármacos neutros y ácidos débiles.
4. Presenta un peso molecular próximo a 3.400.000 Da.

Respuesta correcta: 3. Fija fármacos neutros y ácidos débiles.